Imminent child's birth defined as cervix dilatation up to 7 centimeters

The above is a clinical trial exclusion criterion. Annotated with entity spans:
[Condition: Imminent child's birth] defined as [Measurement: cervix dilatation] up to [Value: 7 centimeters]